¿Qué clase de fármaco es la clozapina?
1. Un ansiolítico.
2. Un antidepresivo.
3. Un antipsicótico.
4. Una benzodiacepina.
5. Un hipnótico.

Respuesta correcta: 3. Un antipsicótico.